Clinical trial exclusion criterion:
Patients with history of bowel obstruction, perforation.

Entity relations:
- Has_temporal("bowel obstruction", "history")
- OR("bowel obstruction", "bowel perforation")